Clinical trial exclusion criterion:
All residents residing near to the well sites that are randomly selected for this study.

Annotated entities:
- Observation: "residing"
- Visit: "near to the well sites"